Which deiodinase polymorphisms are implicated in arterial hypertension?

At least two deiodinease polymorfisms are  implicated in arterial hypertension:
DIO 2 Thr92Ala
rs7140952